American Association of Anesthesiology class 1-3

The above is a clinical trial exclusion criterion. Annotated with entity spans:
[Measurement: American Association of Anesthesiology class] [Value: 1-3]